What is the relationship between the X chromosome and a  neutrophil drumstick?

In particular, up to 17% of neutrophil nuclei of healthy women exhibit a drumstick-shaped appendage that contains the inactive X chromosome.